Clinical trial exclusion criterion:
inability to walk independently for at least 10 minutes, with or without walking devices;

Entity relations:
- Has_qualifier("inability to walk independently", "at least 10 minutes")
- AND("inability to walk independently", "walking devices")